Clinical trial exclusion criterion:
Current use of Amiodarone (Cordarone)

Entity relations:
- Subsumes("Amiodarone", "Cordarone")
- Has_temporal("Amiodarone", "Current")